With a bleeding condition or on anti-coagulant therapy

The above is a clinical trial exclusion criterion. Annotated with entity spans:
With a [Condition: bleeding condition] or on [Procedure: anti-coagulant therapy]